Positive anti-dsDNA.

The above is a clinical trial inclusion criterion. Annotated with entity spans:
[Value: Positive] [Measurement: anti-dsDNA].